Clinical trial inclusion criterion:
H pylori infection failed after at least two eradication therapies

Entity relations:
- Has_multiplier("eradication therapies", "at least two")
- Has_qualifier("eradication therapies", "failed")
- AND("H pylori infection", "eradication therapies")